Clinical trial exclusion criterion:
pregnancy or nursing mothers

Entity relations:
- OR("pregnancy", "nursing")